Scheduled for elective Cesarean Delivery

The above is a clinical trial inclusion criterion. Annotated with entity spans:
[Mood: Scheduled for] [Qualifier: elective] [Procedure: Cesarean Delivery]